En la entrevista clínica:
1. El facultativo tiene que mostrarse amigo antes que profesional.
2. El médico debe evitar advertir al paciente del tiempo que dispone para atenderle.
3. El profesional debe verificar que el paciente ha comprendido la información.
4. Es conveniente realizar pausas prolongadas para no fatigar al paciente.
5. El médico, durante la entrevista, debe permanecer de pie o situado tras la cabecera de la cama.

Respuesta correcta: 3. El profesional debe verificar que el paciente ha comprendido la información.